右側頭臂靜脈（brachiocephalic vein）匯入上腔靜脈（superior vena cava）的位置，對應於體表最有可能在：
A. 胸骨柄（manubrium）右緣
B. 胸骨柄（manubrium）左緣
C. 胸骨體（body）正下方
D. 右側第三肋間

正確答案：A. 胸骨柄（manubrium）右緣